某研究想探討飲水中三氯甲烷濃度與直腸癌的相關性。研究者首先分析 2000 年台灣地區各縣市的直腸癌症發生率，並利用水質監測紀錄得知各縣市自來水供水之三氯甲烷濃度，以此二種資料，研究者進行相關分析。此種研究法稱為：
A. 橫斷式研究
B. 生態研究
C. 世代研究
D. 病例對照研究

正確答案：B. 生態研究